有關何杰金氏淋巴癌（Hodgkin lymphoma）的敘述，下列何者正確？
A. 腫瘤主要是由惡性的小淋巴細胞組成，混雜著由小淋巴細胞轉化而來的 Reed-Sternberg 細胞
B. 腫瘤常以侷限在局部單一淋巴結群表現
C. 對放射線與化學治療反應不佳，是高度惡性腫瘤
D. 淋巴細胞為主（lymphocyte predominance）的亞型與 Epstein-Barr 病毒關係最密切

正確答案：B. 腫瘤常以侷限在局部單一淋巴結群表現